自殺是近年來臺灣社會中越來越引起關注的現象，關於自殺的描述，下列何者最正確？
A. 在流行病學的研究中發現，女性出現自殺行為的比率較男性較少，但自殺死亡率卻比較高
B. 老年族群的自殺死亡率比年輕族群來得高
C. 自殺死亡的族群中，只有10%曾被診斷出任一種精神疾病
D. 過去是否曾有自殺企圖，與未來自殺風險的預測無關

正確答案：B. 老年族群的自殺死亡率比年輕族群來得高